Inability to keep return appointments

The above is a clinical trial exclusion criterion. Annotated with entity spans:
[Observation: Inability to keep return appointments]